在血液平板培養 48 小時後，肺炎鏈球菌（Streptococcus pneumoniae）會產生由綠色圈所包圍的緊密菌落，此現象為下列何者？
A. α型溶血
B. β型溶血
C. γ型溶血
D. 雙區溶血

正確答案：A. α型溶血